Clinical trial exclusion criterion:
The pregnant or lactating woman

Annotated entities:
- Condition: "pregnant"
- Condition: "lactating"
- Person: "woman"